Clinical trial inclusion criterion:
18-80 years

Entity relations:
- Has_value("years", "18-80")